Cyclosporine 抑制異體器官排斥反應（graft rejection）之作用機制為何？
A. 選擇性促進 T 淋巴細胞產生抗體
B. 抑制輔助型 T 淋巴細胞活化
C. 抑制移植細胞增生
D. 減低初級免疫（innate immune）反應

正確答案：B. 抑制輔助型 T 淋巴細胞活化